Clinical trial exclusion criterion:
Exposure to more than four new chemical entities within 12 months prior to the first dosing day.

Annotated entities:
- Multiplier: "more than four"
- Drug: "new chemical entities"
- Undefined_semantics: "new chemical entities"
- Temporal: "within 12 months prior to the first dosing day"
- Reference_point: "the first dosing day"